Provide with written informed consent

The above is a clinical trial inclusion criterion. Annotated with entity spans:
[Post-eligibility: Provide with written informed consent]